Clinical trial inclusion criterion:
participant is willing to sign the study informed consent form

Annotated entities:
- Informed_consent: "participant is willing to sign the study informed consent form"